Clinical trial exclusion criterion:
4. Left ventricular ejection fraction less than 20%.

Annotated entities:
- Measurement: "Left ventricular ejection fraction"
- Value: "less than 20%"